Clinical trial inclusion criterion:
An expected survival of = 3 months;

Annotated entities:
- Observation: "expected survival"
- Value: "= 3 months"